下列有關阿滋海默症的敘述，何者錯誤？
A. 其記憶障礙通常一開始呈現近期記憶障礙（recent memory impairment）
B. 神經纖維纏結（neurofibrillary tangles）為其特有的病理發現，在其他疾病則無神經纖維纏結
C. 目前被認為較有關聯的神經傳導物質為乙醯膽鹼（acetylcholine）和正腎上腺素（norepinephrine）
D. 目前研究發現可能與第 1, 14, 21 對染色體有關

正確答案：B. 神經纖維纏結（neurofibrillary tangles）為其特有的病理發現，在其他疾病則無神經纖維纏結